Clinical trial exclusion criterion:
Discontinuation of proton pump inhibitors, propulsives, antispasmodics, antacids, or bismuth preparations less than 7 days prior to randomization.

Annotated entities:
- Drug: "proton pump inhibitors"
- Drug: "propulsives"
- Drug: "antispasmodics"
- Drug: "antacids"
- Drug: "bismuth preparations"
- Observation: "Discontinuation"
- Temporal: "less than 7 days prior to randomization"
- Reference_point: "randomization"